Clinical trial exclusion criterion:
Known neurological disorders or documented serious head injury.

Annotated entities:
- Condition: "head injury"
- Qualifier: "serious"
- Condition: "neurological disorders"